Clinical trial inclusion criterion:
finnish or/and swedish speaking

Entity relations:
- OR("finnish speaking", "swedish speaking")